Normal semen analysis and mild/moderate male factor (Total motile sperm count > 5 million/ml and/or normal WHO morphology >20%.

The above is a clinical trial inclusion criterion. Annotated with entity spans:
Normal [Measurement: semen analysis] and [Qualifier: mild]/[Qualifier: moderate] [Condition: male factor] ([Measurement: Total motile sperm count] [Value: > 5 million/ml] and/or [Measurement: normal WHO morphology] [Value: >20%].